Clinical trial exclusion criterion:
Patients with seizure disorders, known cardiovascular disease, or cerebrovascular disease.

Entity relations:
- OR("seizure disorders", "cardiovascular disease", "cerebrovascular disease")